Clinical trial exclusion criterion:
allergy to clostridium histolyticum

Entity relations:
- Has_context("allergy", "clostridium histolyticum")